Al llevar a cabo la validación de un método analítico es preciso tener en cuenta los siguientes aspectos básicos:
1. Validar el proceso analítico en su conjunto, el intervalo de concentraciones en que se aplica, así como el método en una única matriz para asegurar la selectividad.
2. Validar las etapas previas de tratamiento de la muestra, el intervalo de concentraciones en que se aplica y el método en una única matriz para asegurar la selectividad.
3. Validar el método de medida final, validar el intervalo de bajas concentraciones (trazas) en que se aplica y el método en una única matriz para asegurar la sensibilidad.
4. Lo único que se precisa es validar la instrumentación mediante calibraciones adecuadas.
5. Validar el proceso analítico en su conjunto, el intervalo de concentraciones en que se aplica y el método en cada una de las matrices a las que se aplicará.

Respuesta correcta: 5. Validar el proceso analítico en su conjunto, el intervalo de concentraciones en que se aplica y el método en cada una de las matrices a las que se aplicará.